Clinical trial exclusion criterion:
Dedicated psychiatric nursing homes

Annotated entities:
- Visit: "psychiatric nursing homes"